Clinical trial inclusion criterion:
Age equal or greater than 70 years

Entity relations:
- Has_value("Age", "equal or greater than 70 years")